有關高鈣風暴（hypercalcemic crisis），下列敘述何者錯誤？
A. 病人多焦躁不安，意識興奮
B. 血鈣超過 16 mg/dL
C. 副甲狀腺增生或癌較易發生
D. 治療應給予 normal saline infusion 及 furosemide

正確答案：A. 病人多焦躁不安，意識興奮